¿Qué tipo de hormona es la calcitonina en base a su naturaleza química?:
1. Peptídica.
2. Esteroide.
3. Colecalciferol.
4. Catecolamina.

Respuesta correcta: 1. Peptídica.